pregnancy, breast feeding

The above is a clinical trial exclusion criterion. Annotated with entity spans:
[Condition: pregnancy], [Observation: breast feeding]